Inability to adhere to protocol.

The above is a clinical trial exclusion criterion. Annotated with entity spans:
[Post-eligibility: Inability to adhere to protocol].